¿Cuál de las siguientes definiciones sobre fluorimetría es correcta?
1. La fluorimetría es menos sensible que la espectrometría.
2. La fluorimetría es menos específica que la espectrometría.
3. Moléculas cíclicas insaturadas son frecuentemente fluorescentes.
4. La fluorescencia es directamente proporcional a la temperatura.
5. Ninguna de las opciones es correcta.

Respuesta correcta: 3. Moléculas cíclicas insaturadas son frecuentemente fluorescentes.